Los grupos fosfato de los nucleótidos:
1. Se estabilizan por unión a aniones divalentes.
2. Forman enlaces de baja energía de hidrólisis.
3. Se denominan X, Y y Z según se alejan de la ribosa.
4. Están unidos al C3´ de la ribosa.
5. Presentan carga negativa.

Respuesta correcta: 5. Presentan carga negativa.